Clinical trial exclusion criteria:
Have participated in this study previously, or any other study using exenatide or GLP-1 analogs.
Have participated in an interventional, medical, surgical, or pharmaceutical study within 30 days of screening.
Have characteristics contraindicating metformin or sulfonylurea use.
Have been treated with exogenous insulin for more than 1 week within the 3 months prior to screening.
Have used drugs for weight loss within 1 month of screening.

Annotated entities:
- Drug: "GLP-1 analogs"
- Observation: "this study"
- Observation: "any other study"
- Drug: "exenatide"
- Observation: "interventional study"
- Observation: "medical study"
- Observation: "surgical study"
- Observation: "pharmaceutical study"
- Temporal: "within 30 days of screening"
- Reference_point: "screening"
- Drug: "metformin"
- Drug: "sulfonylurea"
- Condition: "characteristics contraindicating"
- Drug: "exogenous insulin"
- Multiplier: "for more than 1 week"
- Temporal: "within the 3 months prior to screening"
- Reference_point: "screening"
- Drug: "drugs for weight loss"
- Temporal: "within 1 month of screening"